Clinical trial inclusion criterion:
Primary total hip arthroplasty (THA)

Entity relations:
- Subsumes("total hip arthroplasty", "THA")
- Has_qualifier("total hip arthroplasty", "Primary")